Clinical trial exclusion criterion:
History of Guillain-Barré syndrome

Annotated entities:
- Condition: "Guillain-Barré syndrome"